¿Qué enfermedad sospecharíamos en un paciente joven que refiere historia frecuente de disfagia a sólidos y a líquidos con impactaciones de alimentos repetidas, sin clínica de pirosis y en el que en la endoscopia oral se observan múltiples anillos esofágicos concéntricos con mucosa normal (aspecto traquealizado)?
1. Esofagitis herpética.
2. Esofagitis eosinofílica.
3. Esofagitis candidiásica.
4. Esofagitis por citomegalovirus.
5. Adenocarcinoma de esófago.

Respuesta correcta: 2. Esofagitis eosinofílica.